Clinical trial exclusion criteria:
any condition that would contra-indicate Magnetic Resonance Imaging or administration of contrast agent

Annotated entities:
- Undefined_semantics: "any condition that would contra-indicate Magnetic Resonance Imaging or administration of contrast agent"